Clinical trial inclusion criterion:
20 - 100 yrs old

Annotated entities:
- Person: "old"
- Value: "20 - 100 yrs"